Clinical trial exclusion criterion:
Psychiatric disease

Annotated entities:
- Condition: "Psychiatric disease"